Clinical trial inclusion criterion:
Stable blood pressure regimen, stable lipid regimen, stable diabetes regimen and risk factor control for 6 weeks.

Annotated entities:
- Qualifier: "Stable"
- Procedure: "blood pressure regimen"
- Qualifier: "stable"
- Procedure: "lipid regimen"
- Qualifier: "stable"
- Procedure: "diabetes regimen"
- Procedure: "risk factor control"
- Multiplier: "for 6 weeks"